Clinical trial inclusion criterion:
Age = 18 years old

Annotated entities:
- Person: "Age"
- Value: "= 18 years old"